Written informed consent from participating patients

The above is a clinical trial inclusion criterion. Annotated with entity spans:
[Informed_consent: Written informed consent from participating patients]